Clinical trial exclusion criterion:
emergency surgery

Annotated entities:
- Procedure: "emergency surgery"